Clinical trial inclusion criterion:
Informed consent: Subjects must give their signed and dated written informed consent to participate.

Annotated entities:
- Post-eligibility: "Informed consent: Subjects must give their signed and dated written informed consent to participate."